Clinical trial inclusion criterion:
Patients concurrently treated with oral 5-aminosalicylates or corticosteroids were to receive a stable dose for at least 2 weeks before baseline, and patients receiving AZA and/or 6MP were to receive a stable dose for at least 4 weeks before baseline. Patients were required to maintain stable doses of their concomitant UC medications during the study.

Entity relations:
- Has_temporal("stable dose", "for at least 2 weeks before baseline")
- Has_temporal("stable dose", "for at least 4 weeks before baseline")
- Has_qualifier("AZA", "stable dose")
- Has_qualifier("oral 5-aminosalicylates", "stable dose")
- AND("treated", "oral 5-aminosalicylates")
- OR("oral 5-aminosalicylates", "corticosteroids")
- OR("AZA", "6MP")
- OR("oral 5-aminosalicylates", "AZA")